一位 30 歲男性因近日有食慾變差及倦怠情況而就醫，他沒有腹痛現象。抽血檢驗結果如下：AST （GOT）= 650 U/L（正常值＜37），ALT（GPT）= 600 U/L（正常值＜41），total bilirubin = 3.0 mg/dL （正常值＜1.2），ALP（alkaline phosphatase）= 450U/L（正常值＜104），γ-GT（gamma-glutamyl transpeptidase）=350U/L（正常值＜52），PT（prothrombin time）=11 秒（control 11.1 秒）。腹部超音波檢查沒有發現任何異常。下列敘述何者正確？
A. 若 HBsAg（+），應為 B 型肝炎急性發作
B. 若 Anti-HCV（+），應為 C 型肝炎
C. 很可能為藥物性肝炎
D. 很可能為膽管阻塞而導致肝炎

正確答案：C. 很可能為藥物性肝炎